Describe efforts on Sarcoma from the 100,000 Genomes Project

The largest whole genome sequencing (WGS) endeavour involving cancer and rare diseases was initiated in the UK in 2015 and ran for 5 years. Despite its rarity, sarcoma ranked third overall among the number of patients' samples sent for sequencing. The number of informative genomes produced was reduced further by a PCR amplification step.